肝臟所生產之白蛋白（albumin）在循環系統中扮演下列何種角色？
A. 形成抗體
B. 產生滲透壓
C. 參與凝血機制
D. 參與抗凝血機制

正確答案：B. 產生滲透壓